Clinical trial inclusion criteria:
All patients subjected to deep sedation in ambulant care, having a colonoscopy
ASA 1-3

Annotated entities:
- Procedure: "deep sedation"
- Visit: "ambulant"
- Procedure: "colonoscopy"
- Measurement: "ASA"
- Value: "1-3"